Clinical trial exclusion criterion:
contraindications from manufacturer for medications including currently taking haloperidol, artane, Phenergan (Promethazine), chlorpromazine, erythromycin, Azithromycin, clarithromycin, Ketoconazole, fluconazole, mefloquine (as prophylaxis), lumefantrine (in Coartem), quinine, Septrin

Annotated entities:
- Condition: "contraindications"
- Drug: "haloperidol"
- Drug: "Phenergan"
- Drug: "Promethazine"
- Drug: "artane"
- Drug: "chlorpromazine"
- Drug: "erythromycin"
- Drug: "Azithromycin"
- Drug: "clarithromycin"
- Drug: "Ketoconazole"
- Drug: "fluconazole"
- Drug: "mefloquine"
- Drug: "lumefantrine"
- Drug: "Coartem"
- Drug: "quinine"
- Drug: "Septrin"